Cervical cytology other than PAP I or PAP II (Papanicolaou) or cervical high risk human papillomavirus (HPV) positivity

The above is a clinical trial exclusion criterion. Annotated with entity spans:
[Measurement: Cervical cytology] [Negation: other] than [Qualifier: PAP I] or [Qualifier: PAP II] ([Qualifier: Papanicolaou]) or [Qualifier: cervical high risk] [Qualifier: human papillomavirus] ([Qualifier: HPV]) [Value: positivity]